Clinical trial exclusion criterion:
Congestive heart failure within 6 mo and LVEF < 45%

Annotated entities:
- Condition: "Congestive heart failure"
- Temporal: "within 6 mo"
- Measurement: "LVEF"
- Value: "< 45%"